Patients with prolonged QT-time or other serious cardiac diseases.

The above is a clinical trial exclusion criterion. Annotated with entity spans:
Patients with [Condition: prolonged QT-time] or [Qualifier: other] [Condition: serious cardiac diseases].